Clinical trial exclusion criterion:
Thrombocytosis > 750K

Annotated entities:
- Measurement: "Thrombocytosis"
- Value: "> 750K"